Clinical trial exclusion criterion:
Uncontrolled intercurrent illness including, but not limited to, ongoing or active infection, symptomatic congestive heart failure, unstable angina pectoris, cardiac arrhythmia, or psychiatric illness/social situations that would limit compliance with study requirements.

Annotated entities:
- Qualifier: "Uncontrolled"
- Condition: "intercurrent illness"
- Qualifier: "active"
- Temporal: "ongoing"
- Condition: "infection"
- Qualifier: "symptomatic"
- Condition: "congestive heart failure"
- Condition: "unstable angina pectoris"
- Condition: "cardiac arrhythmia"
- Condition: "psychiatric illness"
- Observation: "social situations that would limit compliance with study requirements"